Any condition requiring antibiotics 14 days prior to arriving for surgery.

The above is a clinical trial exclusion criterion. Annotated with entity spans:
Any condition requiring [Procedure: antibiotics] [Temporal: 14 days prior to arriving for surgery].